2. Patient is scheduled for a non-emergency procedure.

The above is a clinical trial inclusion criterion. Annotated with entity spans:
2. Patient is [Mood: scheduled] for a [Procedure: non-emergency procedure].